一名出生 1250 公克的早產兒發生嚴重的呼吸窘迫及非外傷性腦出血而死亡，解剖時腦出血最常見於：
A. 大腦皮質層表面（cerebral cortex）
B. 小腦半球（cerebellum）
C. 腦室旁胚質層（germinal matrix）
D. 腦幹（brain stem）

正確答案：C. 腦室旁胚質層（germinal matrix）